對單一甲狀腺結節，診斷良性或惡性，最準確之方法是：
A. 甲狀腺超音波
B. 核子醫學影像掃描
C. 電腦斷層
D. 細針細胞穿吸術

正確答案：D. 細針細胞穿吸術